下列何種心臟病，最常合併Wolff-Parkinson-White症候群？
A. Ebstein三尖瓣脈異常
B. 大血管轉位（TGA）
C. 法洛式四合症（TOF）
D. 心室中隔缺損（VSD）

正確答案：A. Ebstein三尖瓣脈異常